Clinical trial exclusion criterion:
Received any experimental drugs or devices within 30 days or 5 half lives, whichever is longer, prior to dosing.

Entity relations:
- Has_temporal("experimental drugs", "within 30 days")
- OR("within 30 days", "within 5 half lives")
- OR("experimental drugs", "experimental devices")